Clinical trial exclusion criterion:
Chronic kidney disease

Annotated entities:
- Condition: "Chronic kidney disease"